Clinical trial exclusion criterion:
Known allergy or contraindication (relative or absolute) to progesterone therapy.

Annotated entities:
- Condition: "allergy"
- Condition: "contraindication"
- Qualifier: "relative"
- Qualifier: "absolute"
- Procedure: "progesterone therapy"